Subjects who are diagnosed as suffering from psychotic illness according to DSM-IV (Axis 1)22, or with a history of CNS disease, a history of infection that might affect CNS (HIV, syphilis, cytomegalovirus, herpes), or a history of head injury with loss of consciousness,pregnant women.

The above is a clinical trial exclusion criterion. Annotated with entity spans:
Subjects who are diagnosed as suffering from [Condition: psychotic illness] according to [Measurement: DSM-IV] ([Qualifier: Axis 1])22, or with a [Temporal: history] of [Condition: CNS disease], a [Temporal: history] of [Condition: infection] that might [Qualifier: affect CNS] ([Condition: HIV], [Condition: syphilis], [Condition: cytomegalovirus], [Condition: herpes]), or a [Temporal: history] of [Condition: head injury] with [Condition: loss of consciousness],[Condition: pregnant] women.